Clinical trial exclusion criterion:
Women under lactation and/or puerperium

Entity relations:
- OR("lactation", "puerperium")